對於胰島素瘤（insulinoma），下列敘述何者錯誤？
A. 神經症狀如精神混亂、視覺模糊，異常行為很常見
B. 交感神經症狀如心悸、手部抖動很常見
C. 可以使用 selective arterial calcium stimulation 及肝靜脈血測定胰島素值來定位腫瘤
D. 皮膚病變 necrolytic migratory erythema 很常見

正確答案：D. 皮膚病變 necrolytic migratory erythema 很常見